鼻咽癌的五年存活率，以下列何種病理型態為最低？
A. keratinizing carcinoma
B. non-keratinizing carcinoma
C. undifferentiated carcinoma
D. adenoid cystic carcinoma

正確答案：A. keratinizing carcinoma